55 歲黃先生過去並無特殊疾病史，最近因為較為疲累，在太太的要求與陪伴下到門診要求作檢查。 下列何者是最好的處理方式？
A. 依全民健康保險的相關規定，開立黃先生想作的檢查項目
B. 依實證醫學的指引，開立黃先生需要的檢查項目
C. 主要與黃先生討論溝通後，了解檢查的動機，再決定進一步的處置
D. 主要與黃太太討論溝通後，了解檢查的動機，再決定進一步的處置

正確答案：C. 主要與黃先生討論溝通後，了解檢查的動機，再決定進一步的處置